下列何疾病在發病後期最少出現手指、腳趾脫皮（desquamation）的現象？
A. roseola
B. scarlet fever
C. Kawasaki disease
D. toxic shock syndrome

正確答案：A. roseola